醫師法規範之「擅自執行醫療業務」，不包括下列何者？
A. 非醫師執行應由醫師執行之醫療行為
B. 非醫師執行任何醫療行為
C. 非醫師在醫師指示下，執行不需由醫師親自執行之醫療行為
D. 非醫師在醫師指示下，執行需由醫師親自執行之醫療行為

正確答案：C. 非醫師在醫師指示下，執行不需由醫師親自執行之醫療行為